What is the physiological role of LKB1 involved in Peutz-Jeghers syndrome?

LKB1 plays a physiological role in controlling the Wnt-signaling.